Please list symptoms of measles.

The leading symptoms of the disease are high fever that presents after an incubation period of 9-10 days and the red rash that begins several days after the fever starts. Beyond specific generalized symptoms, measles may have ocular symptoms. The most commonly occuring satellite symptoms are conjunctivitis, coryza and cough.